En la Espectrometría en el infrarrojo, la región de la huella dactilar permite determinar pequeñas diferencias en la estructura de las moléculas. Esta región se extiende desde, aproximadamente:
1. 4000-3500 cm-1.
2. 3500-2000 cm-1.
3. 2000-1500 cm-1.
4. 1200-800 cm-1.

Respuesta correcta: 4. 1200-800 cm-1.